32歲女性近2個月月經週期紊亂，一個月來潮兩次但經血量卻很少，體重增加3公斤，臉上毛髮增多，超音波下發現兩側卵巢有許多囊狀濾泡。關於此疾病，下列敘述何者錯誤？
A. 又稱作史雷二氏症候群（Stein-Leventhal syndrome）
B. 組織學檢查以stromal hyperthecosis的現象為主
C. 會分泌過量的雄性素
D. 和第二型糖尿病一樣與胰島素抗性有關

正確答案：B. 組織學檢查以stromal hyperthecosis的現象為主